Clinical trial inclusion criterion:
Early pregnancy body weight is 50-90 Kg

Entity relations:
- Has_value("body weight", "50-90 Kg")
- Has_temporal("body weight", "Early pregnancy")